Clinical trial exclusion criterion:
Patient has left ventricular ejection fraction (LVEF) less than 35% not secondary to tachycardia.

Entity relations:
- Subsumes("left ventricular ejection fraction", "LVEF")
- Has_value("left ventricular ejection fraction", "less than 35%")
- Has_mood("tachycardia", "not secondary to")